下列有關Klinefelter's syndrome的敘述，何者錯誤？
A. 細胞之核型（karyotype）多為47, XXY
B. 精蟲數目稀少
C. 其血中之睪固酮（testosterone）分泌量較低
D. 其LH及FSH的分泌量較低

正確答案：D. 其LH及FSH的分泌量較低